Clinical trial exclusion criterion:
Moderate or severe valvular disease.

Annotated entities:
- Condition: "valvular disease"
- Qualifier: "severe"
- Qualifier: "Moderate"